Clinical trial exclusion criterion:
3. Hepatic insufficiency defined as total bilirubin > 2 mg/dL or serum albumin < 25 g/L

Entity relations:
- Has_value("serum albumin", "< 25 g/L")
- Has_value("total bilirubin", "> 2 mg/dL")
- Subsumes("Hepatic insufficiency", "total bilirubin")
- OR("total bilirubin", "serum albumin")